Dentro de las implicaciones presentes en los procesos migratorios para los países receptores se encuentran:
1. El alivio de la presión demográfica.
2. La ruptura de la transmisión cultural.
3. El enriquecimiento cultural.
4. La vulnerabilidad y la desprotección.

Respuesta correcta: 3. El enriquecimiento cultural.